Clinical trial exclusion criterion:
6. Known history of alpha-1-Antitrypsin deficiency

Entity relations:
- Has_temporal("alpha-1-Antitrypsin deficiency", "history")